Clinical trial inclusion criterion:
Histological diagnosis of high grade glandular epithelial neoplasia (Vienna 4-1 to 4-46), possibly multifocal or stage 0 (Tis, N0, M0),

Annotated entities:
- Procedure: "Histological diagnosis"
- Condition: "glandular epithelial neoplasia"
- Measurement: "Vienna"
- Value: "4-1 to 4-46"
- Qualifier: "high grade"
- Qualifier: "multifocal"
- Measurement: "stage"
- Value: "0"
- Measurement: "T"
- Measurement: "N"
- Measurement: "M"
- Value: "0"
- Value: "0"
- Value: "is"